Hypersensitivity to local anesthetics and/or Dexamethasone.

The above is a clinical trial exclusion criterion. Annotated with entity spans:
[Condition: Hypersensitivity] to [Drug: local anesthetics] and/or [Drug: Dexamethasone].